Clinical trial inclusion criterion:
ejection fraction < 40 % as assessed by 2D echocardiography

Entity relations:
- Has_value("ejection fraction", "< 40 %")
- AND("2D echocardiography", "ejection fraction")